Clinical trial exclusion criterion:
5. pre-existing neuropathy and medical conditions or deformities which would compromise block or anesthetic safety

Annotated entities:
- Condition: "neuropathy"
- Temporal: "pre-existing"
- Undefined_semantics: "medical conditions or deformities which would compromise block or anesthetic safety"